How does TNF affect thyroid hormone receptors?

TNF-alpha inhibits the T3-induced expression of thyroid hormone receptor-beta